空氣中的鉛微粒進入人體肺泡區，進入血液循環，最後大部分的鉛會累積在什麼器官或組織？
A. 肝
B. 腎臟
C. 骨骼
D. 脂肪

正確答案：C. 骨骼